慢性精神分裂症患者 S，個人衛生不佳，受聽幻覺干擾，脾氣暴躁，經常半夜大喊大叫，但是 S 不認為自己患有精神疾病，且認為抗精神病藥物有副作用，拒絕就醫；S 之母不忍見 S 之病情惡化，自費請曾診視 S 之精神科專科醫師 D 開立抗精神病藥物之口服滴劑，由 S 之母偷偷加入 S 之飲食中，D 出於好意開立滴劑，S 於不知情之情況下服用後，病情確有改善，但經常抱怨手抖、肌肉僵硬及排尿不順。此個案主要牽涉到那些倫理原則之衝突？
A. 尊重自主原則、不傷害原則與正義原則
B. 尊重自主原則、不傷害原則與行善原則
C. 尊重自主原則、行善原則與正義原則
D. 不傷害原則、行善原則與正義原則

正確答案：B. 尊重自主原則、不傷害原則與行善原則